El electrodo de vidrio combinado con un electrodo de referencia es el dispositivo más empleado para medir el pH de una disolución y se caracteriza porque:
1. Responde a la concentración de hidrogeniones en la disolución.
2. Responde a la actividad de hidrogeniones en la disolución.
3. No necesita calibración con tampones estándares (patrones)
4. Cuando se dispone de soluciones muy alcalinas con concentraciones altas de iones sodio, al realizar las medidas de pH, el electrodo nunca presenta interferencias.

Respuesta correcta: 2. Responde a la actividad de hidrogeniones en la disolución.